Clinical trial exclusion criterion:
Allergy to Pregnyl® or some of its ingredients in the medication or other contraindications due to Pregnyl®

Annotated entities:
- Condition: "Allergy"
- Drug: "Pregnyl"
- Drug: "some of its ingredients"
- Condition: "contraindications"
- Drug: "Pregnyl"